Clinical trial exclusion criterion:
Completely edentulous

Annotated entities:
- Condition: "edentulous"
- Qualifier: "Completely"